Clinical trial exclusion criterion:
Any major surgical procedure in the preceding 30 days.

Entity relations:
- Has_temporal("major surgical procedure", "preceding 30 days")